Clinical trial inclusion criterion:
Body Mass Index (BMI) >21 kg/m^2 and <35 kg/m^2.

Entity relations:
- Has_value("Body Mass Index (BMI)", ">21 kg/m^2 and <35 kg/m^2")